Clinical trial inclusion criterion:
2 target vulnerable lesions

Entity relations:
- Has_multiplier("target vulnerable lesions", "2")